呼吸衰竭表現為低血氧、且無二氧化碳滯留時，且胸部 X 光片無明顯肺浸潤現象，則臨床上須考慮為何種病變？
A. 呼吸中樞病變
B. 呼吸幫浦病變
C. 重度慢性阻塞性肺病變
D. 肺血管病變

正確答案：D. 肺血管病變